Severe hepatic dysfunction (> 3 times normal reference values)

The above is a clinical trial exclusion criterion. Annotated with entity spans:
[Qualifier: Severe] [Condition: hepatic dysfunction] [Non-representable: (> 3 times normal reference values)]